為了早期發現糖尿病腎臟病變，下列何者為最適合的篩檢項目？
A. 肌胺酸酐
B. 尿素氮
C. 微蛋白尿
D. 尿液常規檢查

正確答案：C. 微蛋白尿